Clinical trial exclusion criterion:
Minor surgical procedure (e.g., open biopsy) <=7 days before first dose of study treatment, or not yet recovered from prior minor surgery Note: uncomplicated placement of vascular access device, fine needle aspiration, thoracocentesis or paracentesis >=3 days prior to first dose of study treatment is acceptable.

Annotated entities:
- Procedure: "Minor surgical procedure"
- Procedure: "open biopsy"
- Temporal: "<=7 days before first dose of study treatment"
- Reference_point: "first dose of study treatment"
- Negation: "not yet"
- Condition: "recovered"
- Temporal: "prior"
- Procedure: "minor surgery"